Una mujer de 27 años, embarazada de 10 semanas y con asma alérgico grave persistente. En la actualidad está adecuadamente controlada con budesonida inhalada diaria y salbutamol inhalado a demanda de rescate. Acude a su consulta preocupada por los posibles efectos teratogénicos de su medicación antiasmática. ¿Cuál de las siguientes sería la actitud correcta?
1. Dado que el asma mejora durante el embarazo en la mayoría de pacientes, lo mejor para la paciente y el feto es suspender el tratamiento antiasmático.
2. Suspender la budesonida por haberse relacionado con un riesgo aumentado de malformaciones fetales y reemplazarla por un antileucotrieno oral (montelukast).
3. Retirar el tratamiento actual y reemplazarlo por prednisona oral a la menor dosis posible.
4. Mantener el tratamiento actual y tranquilizar a la paciente acerca de sus efectos secundarios y de la necesidad de un adecuado control del asma durante la gestación.
5. Reemplazar la budesonida por un anticuerpo monoclonal anti-IgE (omalizumab) por su mayor seguridad en el embarazo al no ser un fármaco.

Respuesta correcta: 4. Mantener el tratamiento actual y tranquilizar a la paciente acerca de sus efectos secundarios y de la necesidad de un adecuado control del asma durante la gestación.